Clinical trial inclusion criterion:
Straining during =25% of defecations

Annotated entities:
- Condition: "Straining"
- Multiplier: "=25%"
- Condition: "defecations"